Clinical trial inclusion criterion:
Women with one prior low transverse cesarean delivery

Annotated entities:
- Person: "Women"
- Multiplier: "one"
- Procedure: "low transverse cesarean delivery"